Substance abuse, such as alcohol (>80 g/day), I.V. drugs and inhaled drugs in the past 2 years.

The above is a clinical trial exclusion criterion. Annotated with entity spans:
[Condition: Substance abuse], such as [Qualifier: alcohol] ([Multiplier: >80 g/day]), [Qualifier: I.V. drugs] and [Qualifier: inhaled drugs] [Temporal: in the past 2 years.]